兩歲大男童無意間吞食了一顆圓形鈕釦電池。胸部 X 光檢查顯示該電池卡在食道中段。對此異物最佳的處理方法是：
A. 立刻移除此電池
B. 24 小時後再追蹤胸部 X 光檢查
C. 予多量鋇劑作食道攝影檢查
D. 想辦法將異物推到胃中

正確答案：A. 立刻移除此電池